Clinical trial exclusion criterion:
Clinically significant delusions for which either 1) the frequency of delusions as assessed by the NPI is 'Very frequently', or 2) the frequency of delusions as assessed by the NPI is 'Frequently' AND the severity of the delusions as assessed by the NPI is 'Moderate', or 'Marked'

Annotated entities:
- Condition: "delusions"
- Qualifier: "Clinically significant"
- Multiplier: "frequency of delusions"
- Condition: "delusions"
- Measurement: "NPI"
- Value: "Very frequently"
- Multiplier: "frequency of delusions"
- Condition: "delusions"
- Measurement: "NPI"
- Value: "Frequently"
- Qualifier: "severity of the delusions"
- Condition: "delusions"
- Measurement: "NPI"
- Value: "Moderate"
- Value: "Marked"